Alcohol or drug abuse

The above is a clinical trial inclusion criterion. Annotated with entity spans:
[Condition: Alcohol] or [Condition: drug abuse]